ruptured membranes

The above is a clinical trial exclusion criterion. Annotated with entity spans:
[Condition: ruptured membranes]